How are super enhancers defined?

Super enhancers are chromosomal regions spanned by highly conserved non-coding elements (HCNEs), most of which serve as enhancers of one target gene in the region.